Clinical trial exclusion criterion:
Any condition that in the opinion of study staff would make participation in the study unsafe or interfere with achieving study objectives

Entity relations:
- Has_qualifier("condition", "make participation in the study unsafe")
- OR("make participation in the study unsafe", "interfere with achieving study objectives")